Clinical trial inclusion criterion:
De novo lesion CTO

Entity relations:
- Has_qualifier("CTO", "De novo lesion")